A positive history of chronic claudication,

The above is a clinical trial inclusion criterion. Annotated with entity spans:
A [Temporal: positive history] of [Condition: chronic claudication],